在 2 歲前，皮膚上出現 hypopigmented macules，是下列那種先天性疾病最早出現的皮膚表徵？
A. neurofibromatosis
B. tuberous sclerosis
C. pseudoxanthoma elasticum
D. Albright's syndrome

正確答案：B. tuberous sclerosis